關於心電圖與心動週期所發生事件之間的關聯性敘述，下列何者正確？
A. 接近心室舒張末期時，可觀察到P波
B. QRS複波出現後，心室立即進入等容心室舒張期（isovolumetric ventricular relaxation）
C. T波出現時，心室的體積（ventricular volume）是心動週期中最大的
D. 心房的再極化，通常與T波一起出現在心舒期（diastole）

正確答案：A. 接近心室舒張末期時，可觀察到P波